Clinical trial inclusion criterion:
Treatment naïve or treatment experienced (Peg-RBV or triple therapy).

Entity relations:
- AND("Treatment naïve", "Peg-RBV")
- OR("Treatment naïve", "treatment experienced")
- OR("Peg-RBV", "triple therapy")